癌症常有特殊的腫瘤指標（tumor marker），有關配對敘述，下列何者錯誤？
A. 肝癌（hepatocellular carcinoma）－胎兒蛋白（alpha-fetoprotein, AFP）
B. 大腸癌－CEA（carcinoembryonic antigen）
C. 小細胞肺癌－CA19-9
D. 前列腺癌－PSA（prostate specific antigen）

正確答案：C. 小細胞肺癌－CA19-9